最常和唐氏症（Down syndrome）合併存在之先天性心臟病是下列那一種？
A. 心房中隔缺損
B. 心室中隔缺損
C. 房室瓣中隔缺損
D. 單心室症

正確答案：C. 房室瓣中隔缺損